En las células eucariotas los lípidos de la membrana se sintetizan principalmente en:
1. Retículo endoplásmico rugoso.
2. Aparato de Golgi.
3. Retículo endoplasmático liso.
4. Mitocondrias.
5. Ribosomas.

Respuesta correcta: 3. Retículo endoplasmático liso.